3歲女童有多毛症、乳房增大，身高和骨架看起來猶如十歲的孩童，臨床診斷為早熟的青春期症。下列何者較適合用來治療此種症狀？
A. pegvisomant
B. follitropin
C. octreotide
D. leuprolide

正確答案：D. leuprolide